Previous liver transplantation(more than 6 month).

The above is a clinical trial inclusion criterion. Annotated with entity spans:
[Temporal: Previous] [Procedure: liver transplantation]([Temporal: more than 6 month]).